下列有關 Huntington disease 的敘述，何者錯誤？
A. 除了舞蹈症外，病患常伴有精神症狀
B. 病患常有失智症的現象
C. 家族遺傳病例為一隱性遺傳的疾病
D. 基因的位置在第四對染色體上

正確答案：C. 家族遺傳病例為一隱性遺傳的疾病